Clinical trial exclusion criterion:
3. An ulcer which shows signs of severe clinical infection, defined as pus oozing from the ulcer site

Entity relations:
- Has_qualifier("ulcer", "shows signs of severe clinical infection")
- Subsumes("shows signs of severe clinical infection", "pus")